Clinical trial exclusion criterion:
Serum alanine transaminase > 3 times upper limit of normal

Entity relations:
- Has_value("Serum alanine transaminase", "> 3 times upper limit of normal")